Clinical trial exclusion criterion:
Platelet count < 75 at the time of enrollment

Annotated entities:
- Measurement: "Platelet count"
- Value: "< 75"